Patients who are able to perform SD-OCT

The above is a clinical trial inclusion criterion. Annotated with entity spans:
Patients who are [Mood: able to perform] [Procedure: SD-OCT]